下列有關膝下截肢術後照顧的敘述，何者正確？
A. 為讓病人舒服，在床上擺位時，可在膝關節下放枕頭，讓膝關節保持彎曲
B. 術後因殘肢會腫痛，所以絕對不可按摩
C. 術後殘肢的關節攣縮是無法預防的
D. 術後最好請病人俯臥，1 天數次，1 次 10 至 15 分鐘

正確答案：D. 術後最好請病人俯臥，1 天數次，1 次 10 至 15 分鐘